Clinical trial exclusion criterion:
4. Patients with Magnetic resonance imaging contraindication ,including claustrophobic syndrome patients

Annotated entities:
- Procedure: "Magnetic resonance imaging"
- Condition: "contraindication"
- Condition: "claustrophobic syndrome"